La hipótesis de “balanceo” señala una especificidad de apareamiento de bases menos restrictiva de la base:
1. Del extremo 5´ del codón.
2. Del extremo 5´ del anticodón.
3. Del extremo 3´ del anticodón.
4. Intermedia del codón.

Respuesta correcta: 2. Del extremo 5´ del anticodón.